Clinical trial inclusion criterion:
Patients hospitalized in medical, surgical or ICU wards

Annotated entities:
- Procedure: "hospitalized"
- Visit: "ICU wards"
- Visit: "surgical wards"
- Visit: "medical wards"